Las responsabilidades de la enfermera después de la cateterización cardiaca incluye lo siguiente:
1. Pautar la dosis de antibiótico.
2. Valorar la presencia de pulsos periféricos en la extremidad afectada.
3. Aplicar calor en el lugar de la inserción del catéter.
4. Administrar oxigenoterapia a todos los pacientes durante al menos 4 horas.

Respuesta correcta: 2. Valorar la presencia de pulsos periféricos en la extremidad afectada.